In quadruped mammals, what bones make up the stifle?

In quadruped mammals, the stifle is composed of 3 bones, the femur, the tibia and the patella.